Clinical trial exclusion criterion:
Absence of documentation of negative hepatitis B serologies, absence of completion of treatment for chronic hepatitis B, or absence of suppressive antiviral treatment

Annotated entities:
- Measurement: "hepatitis B serologies"
- Value: "negative"
- Negation: "Absence of"
- Procedure: "treatment"
- Condition: "chronic hepatitis B"
- Negation: "absence of"
- Non-representable: "completion of"
- Procedure: "suppressive antiviral treatment"
- Negation: "absence"